En un meta-análisis de 15 estudios, la incidencia de infarto de miocardio con el nuevo medicamento Tromboclean es del 10,8% en comparación con un 8% con heparina. El riesgo relativo es de 1,35, con un intervalo de confianza al 95% de 1,15 a 1,50 y ausencia de heterogeneidad significativa entre estudios (valor de p de heterogeneidad = 0,95). Señale la respuesta CORRECTA:
1. La heterogeneidad no es significativa, lo cual sugiere que los resultados no son concluyentes.
2. Tromboclean presenta un riesgo de infarto de miocardo similar al de la heparina.
3. No puede descartarse con un 95% de confianza que Tromboclean reduzca el riesgo de infarto de miocardio en un 50%.
4. Tromboclean incrementa el riesgo absoluto de infarto de miocardio entre el 15% y el 50%.
5. La heparina presenta un riesgo de infarto de miocardio significativamente menor que Tromboclean.

Respuesta correcta: 5. La heparina presenta un riesgo de infarto de miocardio significativamente menor que Tromboclean.